Clinical trial exclusion criterion:
Brain, spinal, ophthalmologic, or major surgery or trauma within the past 90 days other than the elective knee/hip surgery

Entity relations:
- Has_negation("elective knee surgery", "other than")
- Has_temporal("surgery", "within the past 90 days")
- Has_qualifier("surgery", "Brain")
- AND("surgery", "elective knee surgery")
- OR("surgery", "trauma")
- OR("Brain", "ophthalmologic", "spinal", "major")
- OR("elective knee surgery", "elective hip surgery")